Clinical trial exclusion criterion:
Female parturient or nursing

Entity relations:
- OR("parturient", "nursing")